一位 50 歲精神分裂症患者出現被害妄想、幻聽、自言自語、情感淡漠等症狀。下列何者屬於此一疾患之負性症狀（negative symptom）？
A. 妄想
B. 幻聽
C. 自言自語
D. 情感淡漠

正確答案：D. 情感淡漠